Clinical trial inclusion criterion:
Patients with SOF/VEL treatment for the treatment of chronic HCV genotype 1 through 6.

Annotated entities:
- Procedure: "SOF/VEL treatment"
- Qualifier: "chronic"
- Measurement: "HCV genotype"
- Value: "1 through 6"